Absolute neutrophil count (ANC) >= 1250/ul

The above is a clinical trial inclusion criterion. Annotated with entity spans:
[Measurement: Absolute neutrophil count] ([Measurement: ANC]) [Value: >= 1250/ul]